CMI > 30

The above is a clinical trial exclusion criterion. Annotated with entity spans:
[Measurement: CMI] [Value: > 3]0